Clinical trial inclusion criterion:
sex in last 6 months with an HIV-infected partner

Annotated entities:
- Observation: "sex"
- Person: "HIV-infected partner"
- Temporal: "in last 6 months"